僧帽瓣狹窄（mitral valve stenosis）最常見的心律不整為：
A. 心房早期收縮（atrial premature contraction）
B. 心室早期收縮（ventricular premature contraction）
C. 心房顫動（atrial fibrillation）
D. 心房撲動（atrial flutter）

正確答案：C. 心房顫動（atrial fibrillation）